2. Recipients of previous non-renal solid organ and/or islet cell transplantation.

The above is a clinical trial exclusion criterion. Annotated with entity spans:
2. Recipients of [Temporal: previous] [Procedure: non-renal solid organ] and/or [Procedure: islet cell transplantation].